Clinical trial exclusion criterion:
History of previous musculoskeletal injury of the same knee for excluding patients with secondary knee osteoarthritis

Annotated entities:
- Condition: "musculoskeletal injury"
- Qualifier: "knee"
- Condition: "secondary knee osteoarthritis"